Have characteristics contraindicating metformin or sulfonylurea use.

The above is a clinical trial exclusion criterion. Annotated with entity spans:
Have [Condition: characteristics contraindicating] [Drug: metformin] or [Drug: sulfonylurea] use.